Clinical trial inclusion criterion:
4. Karnofsky/Lansky score of ≥ 50

Entity relations:
- Has_value("Karnofsky/Lansky score", "≥ 50")